Known or suspected allergy to trial product(s) or related products

The above is a clinical trial exclusion criterion. Annotated with entity spans:
Known or suspected [Condition: allergy to trial product(s)] or [Drug: related products]